Clinical/ Histological/ cytological/ Imaging examination proven Oral/Oropharynx Squamous-cell carcinoma (Tongue, buccal mucosa, mouth floor, hard palate, Molar area), the depth of invasion > 4mm in preoperative assessment

The above is a clinical trial inclusion criterion. Annotated with entity spans:
[Procedure: Clinical]/ [Procedure: Histological]/ [Procedure: cytological]/ [Procedure: Imaging examination] proven [Qualifier: Oral]/[Qualifier: Oropharynx] [Condition: Squamous-cell carcinoma] ([Qualifier: Tongue], [Qualifier: buccal mucosa], [Qualifier: mouth floor], [Qualifier: hard palate], [Qualifier: Molar area]), the [Measurement: depth of invasion] [Value: > 4mm] in [Procedure: preoperative assessment]